Clinical trial exclusion criterion:
endometrial hyperplasia with atypia,

Annotated entities:
- Condition: "endometrial hyperplasia"
- Condition: "atypia"